Clinical trial inclusion criterion:
Provision of written consent

Annotated entities:
- Informed_consent: "Provision of written consent"